胎盤剝離會導致母體血液中何種成分下降？
A. plasmin
B. D-dimer
C. fibrinogen
D. fibrinogen-fibrin degradation products

正確答案：C. fibrinogen